What is the role of SDE2?

SDE2 is an essential gene required for ribosome biogenesis and the regulation of alternative splicing.